diagnosis of moderate to very severe COPD (FEV1 <80% predicted), according to the GesEPOC criteria, established at least 3 months

The above is a clinical trial inclusion criterion. Annotated with entity spans:
diagnosis of [Qualifier: moderate] to [Qualifier: very severe] [Condition: COPD] ([Measurement: FEV1] [Value: <80% predicted]), according to the [Measurement: GesEPOC criteria,] established [Temporal: at least 3 months]